下列有關乳房重建（breast reconstruction）之敘述，何者錯誤？
A. 根蒂式橫式腹直肌皮瓣（pedicled transverse rectus abdominis myocutaneous, TRAM flaps）比游離式橫式腹直肌皮瓣（free TRAM flaps）較容易有脂肪壞死及腹部無力
B. 淺下腹動脈皮瓣（superficial inferior epigastric artery flaps）可以不用犧牲腹直肌
C. 深下腹動脈穿通支皮瓣（deep inferior epigastric artery perforator flaps）不需要肌肉內剝離（intramuscular dissection）
D. 游離皮瓣的recipient vessels通常可以接在胸背動靜脈（thoracodorsal artery and vein）或內乳動靜脈（ internal mammary artery and vein）

正確答案：C. 深下腹動脈穿通支皮瓣（deep inferior epigastric artery perforator flaps）不需要肌肉內剝離（intramuscular dissection）